¿Cuál de las siguientes alteraciones justifica una prolongación del tiempo de protrombina, con normalidad del tiempo de tromboplastina parcial activada, y que se corrige tras la incubación con plasma normal?:
1. Deficiencia de Factor V.
2. Deficiencia de Factor VII.
3. Deficiencia de Factor XII.
4. Inhibidor adquirido frente al factor VIII.

Respuesta correcta: 2. Deficiencia de Factor VII.